Planned postoperative TSH goal other than 0.1-0.5 mU/L

The above is a clinical trial exclusion criterion. Annotated with entity spans:
Planned [Qualifier: postoperative] [Measurement: TSH] goal [Negation: other than] [Value: 0.1-0.5 mU/L]